Clinical trial exclusion criteria:
Upper limb bites
Multiple (> 1) bites
Wound manipulation
Extensive local necrosis or blebs
Seriously-ill patients with hypotension/capillary leak/life threatening bleeding.
Suspected cobra bite, OR
Pregnant/breast-feeding women

Annotated entities:
- Qualifier: "Upper limb"
- Condition: "bites"
- Multiplier: "Multiple"
- Multiplier: "> 1"
- Condition: "bites"
- Observation: "Wound manipulation"
- Condition: "Extensive local necrosis"
- Condition: "Extensive local blebs"
- Condition: "Seriously-ill"
- Condition: "hypotension"
- Condition: "capillary leak"
- Qualifier: "life threatening"
- Condition: "bleeding"
- Condition: "cobra bite"
- Mood: "Suspected"
- Condition: "Pregnant"
- Condition: "breast-feeding"
- Person: "women"